Dentro de las fuentes utilizadas para realizar el diagnóstico de salud de una comunidad, es esencial conocer:
1. Censo de la población.
2. Registro de enfermedades de declaración obligatoria.
3. Suministro de agua potable.
4. Listas de espera.
5. Todas son correctas.

Respuesta correcta: 5. Todas son correctas.